hepatocellular carcinoma (HCC)

The above is a clinical trial exclusion criterion. Annotated with entity spans:
[Condition: hepatocellular carcinoma (HCC)]